Clinical trial exclusion criterion:
Undergoing Interleukin-2 (IL-2) therapy within 8 weeks of study entry

Entity relations:
- Has_temporal("Interleukin-2 (IL-2) therapy", "within 8 weeks of study entry")